Clinical trial inclusion criterion:
Effective methods of birth control include: surgically sterile, barrier device (condom, diaphragm), contraceptive coil, intrauterine device (IUD), and abstinence.

Annotated entities:
- Procedure: "birth control"
- Condition: "surgically sterile"
- Device: "barrier device"
- Device: "condom"
- Device: "diaphragm"
- Device: "contraceptive coil"
- Device: "intrauterine device (IUD)"
- Procedure: "abstinence"
- Grammar_Error: "and"